2. Greater than the age of 18

The above is a clinical trial inclusion criterion. Annotated with entity spans:
[Parsing_Error: 2.] [Value: Greater than] the [Person: age] of 18